What rare disease is associated with a mutation in the GPC6 gene on chromosome 13?

Omodysplasia is a rare autosomal recessive disorder with a frequency of 1 in 50,000 newborn, and is associated with mutations in the GPC6 gene on chromosome 13.